Clinical trial exclusion criterion:
history of allergic disease or reactions likely to be exacerbated by any component of the vaccine

Entity relations:
- multi("exacerbated by any component of the vaccine", "vaccine")
- Has_qualifier("allergic disease", "exacerbated by any component of the vaccine")
- OR("allergic disease", "allergic reactions")